Clinical trial exclusion criterion:
recent surgery (< 3 months)

Entity relations:
- Subsumes("recent", "< 3 months")
- Has_temporal("surgery", "recent")